Clinical trial exclusion criterion:
Any concomitant medical condition that, according to the clinical site investigator would contraindicate participation in the study.

Annotated entities:
- Post-eligibility: "Any concomitant medical condition that, according to the clinical site investigator would contraindicate participation in the study"